Depressed liver function

The above is a clinical trial exclusion criterion. Annotated with entity spans:
[Condition: Depressed liver function]